Clinical trial inclusion criterion:
durg-naive or drug-free

Annotated entities:
- Drug: "durg"
- Negation: "naive"
- Drug: "drug"
- Negation: "free"